Clinical trial inclusion criterion:
Male and female aged =19 and < 65 years.

Entity relations:
- Has_value("aged", "=19 and < 65 years")
- OR("Male", "female")